造成大氣臭氧層破洞，地球生物圈會暴露更多輻射線，增加人類的皮膚癌。為了避免臭氧層被破壞應管制排放的氣體是：
A. 一氧化碳
B. 氟氯化碳
C. 二氧化氮
D. 二氧化硫

正確答案：B. 氟氯化碳